腹部外傷後，腹內壓力過高會造成 Abdominal compartment syndrome。若病患呈現無尿且呼吸衰竭，則腹內壓應達多少 cmH2O？
A. 10
B. 15
C. 20
D. 25

正確答案：D. 25